Clinical trial inclusion criterion:
Patients may have any of the following indications for cardiac catheterization: Thoracic pain under study. Stable chronic coronary disease. Acute myocardial infarction with ST segment elevation, not perfused (without timely reperfusion therapy) with less than 4 weeks of evolution. Acute myocardial infarction with ST-segment elevation, successful thrombolytic therapy, which will undergo drug-invasive therapy. Acute myocardial infarction without ST segment elevation. Unstable angina. Any acute coronary syndrome, to intervene non-infarct-related artery. Disease of any heart valve. Myocarditis or pericarditis. Dilated cardiomyopathy. Patients in renal or cardiac transplantation protocol for any etiology. Congenital heart disease that requires knowing the coronary anatomy prior to surgical correction.

Entity relations:
- AND("indications", "cardiac catheterization")
- Has_qualifier("chronic coronary disease", "Stable")
- Has_qualifier("reperfusion therapy", "timely")
- Has_negation("reperfusion therapy", "without")
- Has_index("with less than 4 weeks of evolution", "evolution")
- Has_temporal("reperfusion therapy", "with less than 4 weeks of evolution")
- AND("Acute myocardial infarction", "ST segment elevation")
- Has_qualifier("thrombolytic therapy", "successful")
- AND("Acute myocardial infarction", "reperfusion therapy")
- AND("Acute myocardial infarction", "ST-segment elevation")
- AND("Acute myocardial infarction", "thrombolytic therapy")
- AND("Acute myocardial infarction", "drug-invasive therapy")
- Has_mood("drug-invasive therapy", "will undergo")
- AND("Acute myocardial infarction", "ST segment elevation")
- Has_negation("ST segment elevation", "without")
- Has_qualifier("artery", "non-infarct-related")
- Has_qualifier("intervene", "artery")
- AND("acute coronary syndrome", "intervene")
- Has_qualifier("Disease", "heart valve")
- Has_qualifier("cardiomyopathy", "Dilated")
- Has_qualifier("Congenital heart disease", "knowing the coronary anatomy")
- Has_temporal("Congenital heart disease", "prior to surgical correction.")
- Has_index("prior to surgical correction.", "surgical correction")
- Subsumes("indications", "Thoracic pain")
- OR("Thoracic pain", "renal transplantation", "Myocarditis", "pericarditis", "Disease", "chronic coronary disease", "Acute myocardial infarction", "Acute myocardial infarction", "Acute myocardial infarction", "Unstable angina", "acute coronary syndrome", "cardiomyopathy", "Congenital heart disease", "cardiac transplantation")